下列有關第一型和第四型過敏免疫反應的描述，何者正確？
A. 第一型過敏免疫的致病機制中，並無 T 細胞參與
B. 第一型過敏免疫反應，接觸抗原到發作的時間較長
C. 第四型過敏免疫反應中，主要參與的抗體是 IgE
D. IFN-γ是參與第四型過敏免疫的重要細胞激素之一

正確答案：D. IFN-γ是參與第四型過敏免疫的重要細胞激素之一